關於胃癌的手術治療，下列何者錯誤？
A. 手術的切除邊緣（resection margin）最好距離胃癌腫瘤（cancer mass）至少5～6公分
B. 次全胃切除併邊緣無癌細胞（subtotal gastrectomy with negative margin）對於遠端胃癌（distal gastric cancer）是適當的
C. 對於胃癌之淋巴腺廓清術（lymphadenectomy），NCCN（National Comprehensive Cancer Network）建議 D2 切除（D2 resection）（至少15個淋巴結）
D. 胃癌的手術治療中，脾切除（splenectomy）是常規的步驟

正確答案：D. 胃癌的手術治療中，脾切除（splenectomy）是常規的步驟